下列有關彩色杜卜勒超音波掃描之描述，那一項不正確？
A. 入射波頻率越高，反射波頻率之改變（Doppler shift）也越大
B. 主要的反射物（reflectors）是血液中的血小板
C. 顏色的涵義包括有無血流、血流方向及血流快慢
D. 反射波頻率改變的大小，與入射波和血流方向的角度有關係

正確答案：B. 主要的反射物（reflectors）是血液中的血小板